Clinical trial inclusion criterion:
Obstructive uropathy

Annotated entities:
- Condition: "Obstructive uropathy"